Known hypersensitivity or allergy to n-acetylcysteine, or receiving chronic therapy with medication that could interact adversely with n-acetylcysteine within 30 days prior to randomization (i.e., nitroglycerin, ACE inhibitors or antihypertensive drugs, anti-coagulants);

The above is a clinical trial exclusion criterion. Annotated with entity spans:
Known [Condition: hypersensitivity] or [Condition: allergy] to [Drug: n-acetylcysteine], or receiving [Procedure: chronic therapy] with medication that could interact adversely with [Drug: n-acetylcysteine] [Temporal: within 30 days prior to randomization] (i.e., [Drug: nitroglycerin], [Drug: ACE inhibitors] or [Drug: antihypertensive drugs], [Drug: anti-coagulants]);